with at least one occlusal or occlusal proximal caries lesion in primary molars

The above is a clinical trial inclusion criterion. Annotated with entity spans:
with [Multiplier: at least one] [Qualifier: occlusal] or [Qualifier: occlusal proximal] [Condition: caries lesion] in [Qualifier: primary molars]